Clinical trial exclusion criterion:
Not willing to participate

Annotated entities:
- Informed_consent: "Not willing to participate"